Clinical trial exclusion criterion:
use of NSAIDs in the 5 days before blood donation;

Annotated entities:
- Drug: "NSAIDs"
- Temporal: "in the 5 days before blood donation"